Hyperfluorescent areas on indocyanine green angiography (ICGA).

The above is a clinical trial inclusion criterion. Annotated with entity spans:
[Condition: Hyperfluorescent areas] on [Procedure: indocyanine green angiography (ICGA)].